History of any skin-related cancer

The above is a clinical trial exclusion criterion. Annotated with entity spans:
[Temporal: History] of any [Condition: skin-related cancer]